Patients receiving benzodiazepines and narcotics.

The above is a clinical trial exclusion criterion. Annotated with entity spans:
Patients receiving [Drug: benzodiazepines] and [Drug: narcotics].